Prior use of levothyroxine

The above is a clinical trial exclusion criterion. Annotated with entity spans:
[Temporal: Prior] use of [Drug: levothyroxine]